Neurogenic bladder

The above is a clinical trial exclusion criterion. Annotated with entity spans:
[Condition: Neurogenic bladder]